Clinical trial exclusion criterion:
Contraindications to etomidate (sepsis, primary or secondary adrenal insufficiency, porphyria)

Annotated entities:
- Condition: "Contraindications"
- Drug: "etomidate"
- Condition: "sepsis"
- Qualifier: "primary"
- Qualifier: "secondary"
- Condition: "adrenal insufficiency"
- Condition: "porphyria"